7. Are taking megestrol acetate and continue to lose weight despite at least 2 weeks of therapy.

The above is a clinical trial inclusion criterion. Annotated with entity spans:
7. [Temporal: Are taking] [Drug: megestrol acetate] and [Temporal: continue] to [Observation: lose weight] despite [Temporal: at least 2 weeks] of [Procedure: therapy].